Elective surgery

The above is a clinical trial inclusion criterion. Annotated with entity spans:
[Procedure: Elective surgery]